感染性心內膜炎最不容易發生於下列何種心臟病？
A. 主動脈狹窄
B. 二尖瓣狹窄
C. 肺動脈狹窄
D. 心房中隔缺損

正確答案：D. 心房中隔缺損